Clinical trial exclusion criterion:
Subjects with hypersensitivity reaction to Statin and Ezetimibe

Annotated entities:
- Condition: "hypersensitivity"
- Drug: "Statin"
- Drug: "Ezetimibe"